Clinical trial exclusion criterion:
re-admission to ICU and has been enrolled during former admission to ICU

Entity relations:
- AND("re-admission", "ICU")